Clinical trial exclusion criterion:
Incarcerated individuals

Annotated entities:
- Person: "Incarcerated individuals"